Clinical trial exclusion criterion:
Active smoking (within the past year)

Annotated entities:
- Qualifier: "Active"
- Observation: "smoking"
- Value: "within the past year"